缺乏維生素B1（thiamine）而引起的代謝性乳酸中毒（lactic acidosis）與下列那個酵素的功能異常有關？
A. 異檸檬酸脫氫酶（isocitrate dehydrogenase）
B. 乳酸脫氫酶（lactate dehydrogenase）
C. 蘋果酸脫氫酶（malate dehydrogenase）
D. 丙酮酸脫氫酶複合體（pyruvate dehydrogenase complex）

正確答案：D. 丙酮酸脫氫酶複合體（pyruvate dehydrogenase complex）